Clinical trial exclusion criterion:
Other significant medical illness that might interfere with this study: significant pulmonary dysfunction in the previous 6 months, malignancy other than skin basocellular carcinoma in previous 5 years, immunodeficiency syndromes (e.g. HIV positivity, auto-immune diseases, organ transplants other than cornea and hair transplant)

Entity relations:
- Has_qualifier("medical illness", "significant")
- Has_negation("cornea transplant", "other than")
- Subsumes("immunodeficiency syndromes", "HIV positivity")
- Has_negation("skin basocellular carcinoma", "other than")
- Has_temporal("malignancy", "in previous 5 years")
- Has_qualifier("pulmonary dysfunction", "significant")
- Has_temporal("pulmonary dysfunction", "in the previous 6 months")
- Subsumes("medical illness", "pulmonary dysfunction")
- Has_temporal("skin basocellular carcinoma", "in previous 5 years")
- OR("cornea transplant", "hair transplant")
- OR("HIV positivity", "organ transplants", "auto-immune diseases")
- OR("pulmonary dysfunction", "malignancy", "immunodeficiency syndromes")